Clinical trial inclusion criterion:
Subjects were to, in the opinion of the investigator, have no clinically significant abnormal findings of renal and hepatic function as determined by serum creatinine, total bilirubin, and transaminase levels.

Annotated entities:
- Subjective_judgement: "in the opinion of the investigator"
- Measurement: "serum creatinine"
- Measurement: "total bilirubin"
- Measurement: "transaminase levels"
- Measurement: "hepatic function"
- Measurement: "renal function"
- Qualifier: "clinically significant"
- Condition: "abnormal findings"
- Negation: "no"